有關肺部復健（pulmonary rehabilitation）的描述，下列何者錯誤？
A. 治療的對象包括阻塞性肺疾病、限制性肺疾病、神經肌肉病變、脊髓損傷患者等
B. 主要的目的在逆轉肺部組織的病理變化
C. 復健內容除了呼吸訓練、排痰外，也包括藥物優化、生理功能的評估和對失能的應對方式（coping skills），教育、營養諮詢及精神社會支持等
D. 訓練結果常可使患者增加運動耐受力，改善生活功能，增加生活品質，更進一步減少醫療資源的耗用

正確答案：B. 主要的目的在逆轉肺部組織的病理變化